En el tratamiento del trastorno depresivo mayor, ¿qué ventajas tienen los inhibidores selectivos de la recaptación de la serotonina (ISRS) en comparación a los antidepresivos tricíclicos?
1. Son más eficaces.
2. Llevan utilizándose desde hace más tiempo, mientras que los antidepresivos tricíclicos son más modernos y no se conocen bien.
3. Presentan menos efectos secundarios.
4. Su eficacia ha sido probado en estudios controlados, mientras que los antidepresivos tricíclicos todavía no han sido evaluados en estudios controlados.
5. No tienen ninguna ventaja clara.

Respuesta correcta: 3. Presentan menos efectos secundarios.